Capability to understand the Informed Consent Form;

The above is a clinical trial inclusion criterion. Annotated with entity spans:
[Non-query-able: Capability to understand the Informed Consent Form;]